Lucid and without diagnosis of any psychiatric disorder;

The above is a clinical trial inclusion criterion. Annotated with entity spans:
[Condition: Lucid] and [Negation: without] diagnosis of any [Condition: psychiatric disorder];